severe hepatic impairment

The above is a clinical trial exclusion criterion. Annotated with entity spans:
[Qualifier: severe] [Condition: hepatic impairment]